¿Qué trastorno de personalidad se caracteriza por una necesidad profunda y generalizada de que cuiden de él/ella, lo que lleva a una conducta de sumisión, quejas y miedos de separación?:
1. Límite.
2. Esquizotípico.
3. Obsesivo-compulsivo.
4. Por dependencia.

Respuesta correcta: 4. Por dependencia.